History of psychotic disorder or manic episode diagnosed by MINI-KID

The above is a clinical trial exclusion criterion. Annotated with entity spans:
[Temporal: History] of [Condition: psychotic disorder] or [Condition: manic episode] diagnosed by [Procedure: MINI-KID]